Clinical trial inclusion criterion:
1. Subjects must have recurrent or persistent platinum-resistant epithelial ovarian, fallopian tube, or primary peritoneal carcinoma with measureable disease (as defined by RECIST 1.1.) after first or second line platinum-based chemotherapy, for which treatment with PLD is indicated. Platinum-based therapy is defined as treatment with carboplatin, cisplatin or another organoplatinum compound. Platinum-resistant is defined as having a platinum-free interval (PFI) of < 12 months after first- or second-line platinum-based chemotherapy, or having disease progression while receiving second-line platinum-based chemotherapy.

Annotated entities:
- Parsing_Error: "1."
- Condition: "primary peritoneal carcinoma"
- Condition: "carcinoma fallopian tube"
- Condition: "carcinoma epithelial ovarian"
- Qualifier: "recurrent"
- Qualifier: "persistent"
- Qualifier: "platinum-resistant"
- Condition: "measureable disease"
- Temporal: "after first line platinum-based chemotherapy"
- Reference_point: "first line platinum-based chemotherapy"
- Temporal: "after second line platinum-based chemotherapy"
- Reference_point: "second line platinum-based chemotherapy"
- Procedure: "treatment with PLD"
- Drug: "PLD"
- Qualifier: "indicated"
- Undefined_semantics: "indicated"
- Subjective_judgement: "indicated"
- Procedure: "Platinum-based therapy"
- Drug: "carboplatin"
- Drug: "cisplatin"
- Drug: "another organoplatinum compound"
- Not_a_criteria: "Platinum-based therapy is defined as treatment with carboplatin, cisplatin or another organoplatinum compound."
- Measurement: "platinum-free interval (PFI)"
- Temporal: "< 12 months after first- or second-line platinum-based chemotherapy"
- Reference_point: "first- or second-line platinum-based chemotherapy"
- Condition: "Platinum-resistant"
- Condition: "disease progression"
- Procedure: "second-line platinum-based chemotherapy"